What is Desomorphine?

Desomorphine is the semi-synthetic opioid claimed to be the main component of krokodil